下列症候何者不屬於腫瘤溶解症候群（tumor lysis syndrome）的表徵？
A. 高鉀血症（hyperkalemia）
B. 高磷血症（hyperphosphatemia）
C. 高鈣血症（hypercalcemia）
D. 腎衰竭（renal failure）

正確答案：C. 高鈣血症（hypercalcemia）